Las bacterias del género Pseudomonas:
1. Son anaerobias estrictas.
2. Tienen un metabolismo fermentador.
3. No tienen falgelos.
4. Tienen un metabolismo respirador.

Respuesta correcta: 4. Tienen un metabolismo respirador.